Clinical trial inclusion criterion:
Tolerating tuberculosis therapy containing rifampin for the 2 weeks prior to screening,except for persons taking protease inhibitors at time of diagnosis of TB.,. Subjects taking protease inhibitors will be screened and initiate visit 1 within 3 days of starting TB medication

Annotated entities:
- Condition: "tuberculosis"
- Procedure: "tuberculosis therapy"
- Drug: "rifampin"
- Temporal: "for the 2 weeks prior to screening"
- Reference_point: "screening"
- Drug: "protease inhibitors"
- Negation: "except"
- Temporal: "at time of diagnosis of TB"
- Reference_point: "time of diagnosis of TB"